Clinical trial exclusion criterion:
Patients with seizure disorders, known cardiovascular disease, or cerebrovascular disease.

Annotated entities:
- Condition: "seizure disorders"
- Condition: "cardiovascular disease"
- Condition: "cerebrovascular disease"